Clinical trial exclusion criterion:
Treatment with anticholinergic medication in the last 2 months

Entity relations:
- Has_temporal("anticholinergic medication", "last 2 month")